chronic kidney disease

The above is a clinical trial exclusion criterion. Annotated with entity spans:
[Condition: chronic kidney disease]